Clinical trial exclusion criterion:
Children and caregivers who are unable to complete assessments for any reason;

Annotated entities:
- Informed_consent: "Children and caregivers who are unable to complete assessments for any reason"